Clinical trial exclusion criterion:
undergoing anterior spine multi-level instrumentation surgery

Entity relations:
- Has_qualifier("multi-level instrumentation surgery", "anterior spine")
- Has_temporal("multi-level instrumentation surgery", "undergoing")